Clinical trial exclusion criterion:
Patients with systemic, rheumatic or inflammatory disease of the knee or chondrocalcinosis, hemochromatosis, inflammatory arthritis, arthropathy of the knee associated with juxta-articular Paget's disease of the femur or tibia, hemophilic arthropathy, infectious arthritis, Charcot's knee joint, villonodular synovitis, and synovial chondromatosis

Annotated entities:
- Condition: "chondrocalcinosis"
- Condition: "hemochromatosis"
- Condition: "inflammatory arthritis"
- Condition: "arthropathy of the knee"
- Condition: "Paget's disease"
- Condition: "hemophilic arthropathy"
- Condition: "infectious arthritis"
- Condition: "Charcot's knee joint"
- Condition: "villonodular synovitis"
- Condition: "synovial chondromatosis"
- Parsing_Error: "and"
- Qualifier: "femur"
- Qualifier: "tibia"
- Qualifier: "juxta-articular"
- Qualifier: "knee"
- Condition: "inflammatory disease"
- Condition: "rheumatic disease"
- Condition: "systemic disease"